Clinical trial exclusion criterion:
Child-bearing period women without effective contraceptive measures, pregnancy and lactation.

Annotated entities:
- Pregnancy_considerations: "Child-bearing period women without effective contraceptive measures, pregnancy and lactation"